Clinical trial inclusion criterion:
Has a potential post-operative pinhole corrected Snellen VA of at least 20/200 or better in both eyes

Annotated entities:
- Measurement: "pinhole corrected Snellen VA"
- Value: "at least 20/200 or better"
- Qualifier: "both eyes"